Clinical trial inclusion criterion:
The cirrhotic malnourished patients who were diagnosed as liver cancer preoperatively and underwent hepatectomy were consecutively enrolled.

Annotated entities:
- Condition: "cirrhotic"
- Condition: "malnourished"
- Condition: "liver cancer"
- Temporal: "preoperatively"
- Procedure: "hepatectomy"